Clinical trial exclusion criterion:
Emergency surgery

Entity relations:
- multi("Emergency surgery", "Emergency")